Clinical trial exclusion criterion:
patient with severe renal failure;

Entity relations:
- Has_qualifier("renal failure", "severe")